4. Karnofsky/Lansky score of ≥ 50

The above is a clinical trial inclusion criterion. Annotated with entity spans:
[Parsing_Error: 4.] [Measurement: Karnofsky/Lansky score] of [Value: ≥ 50]